Clinical trial exclusion criterion:
Airway anomalies;

Annotated entities:
- Condition: "Airway anomalies"